Having comorbid psychiatric conditions according to the criteria set forth in the DSM-IV(administered by the Mini-International Neuropsychiatric Interview (MINI))

The above is a clinical trial exclusion criterion. Annotated with entity spans:
Having [Qualifier: comorbid] [Condition: psychiatric conditions] according to the criteria set forth in the [Qualifier: DSM-IV](administered by the Mini-International Neuropsychiatric Interview (MINI))